Clinical trial inclusion criterion:
Subjects who are within their ideal body weight (BMI between >17 and =28 kg/m2)

Entity relations:
- Has_value("BMI", "between >17 and =28 kg/m2")